What is RADICL-seq?

RADICL-seq is a technology that maps genome-wide RNA-chromatin interactions in intact nuclei. It identifies distinct patterns of genome occupancy for different classes of transcripts as well as cell type-specific RNA- chromatin interactions, and highlights the role of transcription in the establishment of chromatin structure.